Clinical trial inclusion criterion:
Measureable disease defined as: ≥ 1 lesion ≥ 1.5 cm single dimension via CT, CT/PET with nodal or mass lesions; Quantifiable circulating tumor cells; or for Waldenström's macroglobulinemia presence of IgM l > 2X ULN; For CTCL: mSWAT > 0

Annotated entities:
- Condition: "Measureable disease"
- Multiplier: "≥ 1 lesion"
- Measurement: "≥ 1.5 cm single dimension"
- Value: "≥ 1.5 cm"
- Procedure: "CT"
- Procedure: "CT/PET"
- Condition: "mass lesions"
- Condition: "nodal lesions"
- Condition: "circulating tumor cells"
- Condition: "Waldenström's macroglobulinemia"
- Measurement: "IgM l"
- Value: "> 2X ULN"
- Condition: "CTCL"
- Measurement: "mSWAT"
- Value: "> 0"